Clinical trial exclusion criterion:
Patients with severe cognitive impairment.

Annotated entities:
- Condition: "cognitive impairment"
- Qualifier: "severe"